神經內分泌瘤（neuroendocrine tumor）常常會出現肝臟轉移，有時在原發部位已經手術清除後，才在肝臟發現轉移病灶。面對此類病人時，下列敘述何者錯誤？
A. 在肝內轉移性神經內分泌瘤中，類癌（carcinoid tumor）是比較常見的轉移種類
B. 大部分此類肝腫瘤生長非常緩慢，常常不治療也能長時間存活
C. 此類肝腫瘤對於手術切除，無線電射頻消融（RFA）或是經動脈化學栓塞治療（TACE）都是可以考慮的治療選項
D. 有些病人會出現荷爾蒙相關症狀，此時長效 somatostatin analogues 會有幫助

正確答案：A. 在肝內轉移性神經內分泌瘤中，類癌（carcinoid tumor）是比較常見的轉移種類